Clinical trial exclusion criterion:
Allergy or previous adverse reaction to prazosin or other alpha-1 antagonist

Entity relations:
- Has_temporal("adverse reaction", "previous")
- Has_qualifier("alpha-1 antagonist", "other")
- AND("Allergy", "prazosin")
- OR("prazosin", "alpha-1 antagonist")
- OR("Allergy", "adverse reaction")